Clinical trial inclusion criterion:
Able to take oral medication

Annotated entities:
- Observation: "Able to take oral medication"
- Drug: "oral medication"